Clinical trial exclusion criterion:
Cholesterol-lowering drugs

Annotated entities:
- Drug: "Cholesterol-lowering drugs"